Clinical trial exclusion criterion:
Contra-indications to non-steroidal anti-inflammatory drugs: 1) history of hypersensitivity to NSAIDs or aspirin 2) active or history of peptic ulcer disease, chronic dyspepsia, or active or history of gastrointestinal bleed 3) Severe heart failure (NYHA 2 or worse) 4) hypertension (JNC7 stage 2 or worse) 5) Chronic kidney disease 3 or worse 6) Current use of anti-coagulants 7) Hepatitis 8) Alcoholism

Entity relations:
- Has_temporal("hypersensitivity", "history")
- AND("hypersensitivity", "NSAIDs")
- Has_temporal("peptic ulcer disease", "active")
- Has_temporal("gastrointestinal bleed", "active")
- Has_value("NYHA", "2 or worse")
- Subsumes("Severe", "NYHA")
- Has_qualifier("heart failure", "Severe")
- Has_value("JNC7 stage", "2 or worse")
- Has_temporal("anti-coagulants", "Current")
- AND("Contra-indications", "non-steroidal anti-inflammatory drugs")
- AND("hypertension", "JNC7 stage")
- Subsumes("Contra-indications", "hypersensitivity")
- OR("NSAIDs", "aspirin")
- OR("active", "history")
- OR("active", "history")
- OR("peptic ulcer disease", "chronic dyspepsia")
- OR("hypersensitivity", "peptic ulcer disease", "gastrointestinal bleed", "heart failure", "hypertension", "Chronic kidney disease", "anti-coagulants", "Hepatitis", "Alcoholism")